Clinical trial exclusion criterion:
Presence of another pathology that could influence exercise tolerance

Entity relations:
- Has_qualifier("pathology", "influence exercise tolerance")
- Has_qualifier("pathology", "another")